Age > 20 y/o.

The above is a clinical trial inclusion criterion. Annotated with entity spans:
[Person: Age] [Value: > 20 y/o].